關於「心理治療之醫病關係」，下列那一個敘述中的醫師作為較恰當？
A. 醫師為末期病人進行支持性心理治療，於治療順利終止後，僅有數日壽命之病人希望能與醫師最後擁抱一次，醫師可以答應病人之要求
B. 心理治療過程中，為了慶祝治療週年，醫師可以與病人相約共進晚餐、欣賞藝術表演
C. 心理治療過程中，醫師可以接受病人之理財建議，請病人代為投資股票
D. 心理治療過程中，醫師可以向病人透露自己過去的戀愛與離婚經驗，鼓勵病人勇於離婚

正確答案：A. 醫師為末期病人進行支持性心理治療，於治療順利終止後，僅有數日壽命之病人希望能與醫師最後擁抱一次，醫師可以答應病人之要求